Clinical trial exclusion criterion:
Had unprotected sexual intercourse within 30 days before study entry and who do not agree to use a highly effective method of contraception (eg, total abstinence, an intrauterine device, a double-barrier method [such as condom plus diaphragm with spermicide], a contraceptive implant, an oral contraceptive, or have a vasectomized partner with confirmed azoospermia) throughout the entire study period and for 28 days after study drug discontinuation

Entity relations:
- Has_index("within 30 days before study entry", "study entry")
- Has_temporal("unprotected sexual intercourse", "within 30 days before study entry")
- Has_qualifier("method of contraception", "highly effective")
- Has_value("abstinence", "total")
- AND("partner", "vasectomized")
- AND("partner", "azoospermia")
- Subsumes("double-barrier method", "condom")
- Has_index("throughout the entire study period", "the entire study period")
- Has_index("for 28 days after study drug discontinuation", "study drug discontinuation")
- multi("study drug discontinuation", "study drug")
- Subsumes("method of contraception", "abstinence")
- Has_context("method of contraception", "do not agree")
- Has_temporal("method of contraception", "throughout the entire study period")
- Has_temporal("method of contraception", "for 28 days after study drug discontinuation")
- Subsumes("double-barrier method", "diaphragm with spermicide")
- OR("condom", "contraceptive implant", "oral contraceptive", "partner")
- OR("abstinence", "intrauterine device", "double-barrier method")
- OR("diaphragm with spermicide", "contraceptive implant", "oral contraceptive", "partner")